Clinical trial exclusion criterion:
Milller Class 4 recession defects

Annotated entities:
- Measurement: "Milller"
- Value: "Class 4"
- Condition: "recession defects"